Clinical trial exclusion criterion:
ongoing antibiotic treatment at the day of inclusion

Entity relations:
- AND("treatment", "antibiotic")
- Has_temporal("treatment", "at the day of inclusion")
- Has_index("at the day of inclusion", "day of inclusion")